有關肌肉病變之敘述，下列何者錯誤？
A. 高血鉀性週期性麻痺（periodic paralysis）為鈉離子通道異常疾病
B. 低血鉀性週期性麻痺（periodic paralysis）為鈣離子通道異常疾病
C. 裘馨氏肌肉失養症（Duchenne muscular dystrophy）為體染色體顯性遺傳疾病
D. 皮肌炎（dermatomyositis）為免疫異常疾病

正確答案：C. 裘馨氏肌肉失養症（Duchenne muscular dystrophy）為體染色體顯性遺傳疾病